Clinical trial exclusion criteria:
Subjects with a supine BP >140 mm Hg systolic or >90 mm Hg diastolic or <100 mm Hg systolic or <60 mm Hg diastolic based on the average of the triplicate
Serum potassium >=5.1 mmol/L or <3.5 mmol/L at screening, confirmed by a single repeat if deemed necessary.
Estimated GFR <60 mL/min/1.73 m2 using the Cockcroft-Gault formula measurement of the individual parameters following at least 5 minutes of rest at Screening.

Annotated entities:
- Measurement: "supine BP"
- Value: ">140 mm Hg systolic"
- Value: ">90 mm Hg diastolic"
- Value: "<100 mm Hg systolic"
- Value: "<60 mm Hg diastolic"
- Measurement: "Serum potassium"
- Value: ">=5.1 mmol/L"
- Value: "<3.5 mmol/L"
- Temporal: "at screening"
- Measurement: "Estimated GFR"
- Value: "<60 mL/min/1.73 m2"
- Observation: "Cockcroft-Gault formula"